Clinical trial inclusion criterion:
Planned to use patient-controlled intravenous analgesia after surgery;

Entity relations:
- Has_qualifier("intravenous analgesia", "patient-controlled")
- Has_temporal("intravenous analgesia", "after surgery")
- Has_index("after surgery", "surgery")
- multi("surgery", "surgery")